Clinical trial inclusion criterion:
Bilateral symmetrically impacted lower third molars according to Pel-Gregory's and Winter's classification

Entity relations:
- Has_value("Pel-Gregory's and Winter's classification", "Bilateral symmetrically impacted lower third molars")